Subjects (females) with active sexual life that do not use a contraceptive method.

The above is a clinical trial exclusion criterion. Annotated with entity spans:
Subjects ([Person: females]) with [Observation: active sexual life] that do [Negation: not] use a [Procedure: contraceptive method].